Acquired deficiency of coagulation factors whose treatment is established

The above is a clinical trial exclusion criterion. Annotated with entity spans:
[Condition: Acquired deficiency of coagulation factors] [Qualifier: whose treatment is established]